Clinical trial exclusion criterion:
Patients with plan to decannulate from ECMO within 48 hours

Annotated entities:
- Temporal: "within 48 hours"
- Procedure: "decannulate from ECMO"